El trastorno neurológico degenerativo que se produce como consecuencia de una degeneración y pérdida de las neuronas dopaminérgicas nigroestriatales se denomina:
1. Fenilcenoturia.
2. Encefalopatía espongiforme transmisible o EET.
3. Esclerosis múltiple.
4. Enfermedad de Huntinton.
5. Enfermedad de Parkinson.

Respuesta correcta: 5. Enfermedad de Parkinson.